Stable (8 wks or longer) concurrent medications including benzodiazepines, sedative hypnotics, antipsychotics, and antidepressants.

The above is a clinical trial inclusion criterion. Annotated with entity spans:
[Qualifier: Stable] ([Temporal: 8 wks or longer]) [Qualifier: concurrent] [Drug: medications] including [Drug: benzodiazepines], [Drug: sedative hypnotics], [Drug: antipsychotics], and [Drug: antidepressants].